Affiliation of health care assurance

The above is a clinical trial exclusion criterion. Annotated with entity spans:
[Observation: Affiliation of health care assurance]